Subjects are dapsone-naive.

The above is a clinical trial inclusion criterion. Annotated with entity spans:
Subjects are [Drug: dapsone]-[Negation: naive].